特定遺傳疾病常以胎兒期超音波頸部透明帶（nuchal translucency）變厚與兒童期蹼狀頸（web neck）為特徵，其中何者最不可能？
A. Cornelia de Lange syndrome
B. Down syndrome
C. Noonan syndrome
D. Turner syndrome

正確答案：A. Cornelia de Lange syndrome